First single stroke ischaemic or haemorrhagic responsible of an hemiplegia

The above is a clinical trial inclusion criterion. Annotated with entity spans:
[Multiplier: First] [Multiplier: single] [Condition: stroke] [Qualifier: ischaemic] or [Qualifier: haemorrhagic] responsible of an [Condition: hemiplegia]